下列有關尿素循環（urea cycle）的敘述，何者錯誤？
A. 尿素循環主要於肝臟中進行
B. 尿素循環的產物之一為草醯乙酸（oxaloacetate）
C. 尿素循環的一部分反應於粒線體內進行，另一部分反應則在細胞質中進行
D. 在人體中，尿素循環可將含氮的代謝物轉變為尿素

正確答案：B. 尿素循環的產物之一為草醯乙酸（oxaloacetate）